Se denomina pico base en un espectro de masas a:
1. El pico más grande o intenso.
2. El pico par más pesado.
3. El pico isotópico más ligero.
4. El pico que se corresponde con su masa nominal.
5. El pico impar más pesado.

Respuesta correcta: 1. El pico más grande o intenso.